Clinical trial exclusion criterion:
Known furosemide hypersensitivity.

Entity relations:
- AND("hypersensitivity", "furosemide")